Clinical trial inclusion criterion:
Ovarian Reserve: number of antral follicles 2 millimeter (mm) between 6 <= antral follicle count (AFC) <= 16

Annotated entities:
- Measurement: "number of antral follicles 2 millimeter (mm)"
- Value: "between 6 <= antral follicle count (AFC) <= 16"